What is the target of Sotorasib?

Sotorasib is a KRASG12C inhibitor.